26 歲女性，G2P1，妊娠 40 週產前胎兒超音波檢查，下列何者為異常？
A. 胎兒胎頭橫徑（biparietal diameter, BPD）50 mm
B. 胎兒股骨長（femur length, FL）70 mm
C. 胎兒腹圍 35 cm
D. 羊水指數（amniotic fluid index, AFI）20 cm

正確答案：A. 胎兒胎頭橫徑（biparietal diameter, BPD）50 mm